Clinical trial inclusion criterion:
Must have failed after fluoropyrimidine-, oxaliplatin-, and irinotecan-containing chemotherapy regimens for metastatic disease. Failure is defined as either disease progression (clinical or radiological) or intolerance to the regimen. Metastatic relapse within 6 months after completing adjuvant chemotherapy (with either an irinotecan or oxaliplatin containing regimen) will also be considered as treatment failure of a prior regimen for metastatic disease. Laboratory: Adequate baseline organ function defined by (<=7 days prior to first dose of study treatment).

Entity relations:
- AND("fluoropyrimidine- containing chemotherapy", "metastatic disease")
- Has_qualifier("fluoropyrimidine- containing chemotherapy", "failed")
- AND("intolerance", "the regimen")
- Has_temporal("Metastatic relapse", "within 6 months after completing adjuvant chemotherapy")
- AND("Metastatic relapse", "irinotecan containing regimen")
- Has_index("<=7 days prior to first dose of study treatment", "first dose of study treatment")
- Has_temporal("Adequate baseline organ function", "<=7 days prior to first dose of study treatment")
- Subsumes("failed", "disease progression")
- Has_index("within 6 months after completing adjuvant chemotherapy", "after completing adjuvant chemotherapy")
- OR("fluoropyrimidine- containing chemotherapy", "oxaliplatin- containing chemotherapy", "irinotecan-containing chemotherapy")
- OR("irinotecan containing regimen", "oxaliplatin containing regimen")
- OR("disease progression", "intolerance", "Metastatic relapse")